心包填塞（cardiac tamponade）是下列那一個情形？ 中心靜脈壓 動脈壓 心輸出量 混合靜脈血氧飽和度  A 	↓ 	↓ 	↓ 	↓ B 	↑ 	↓ 	↓ 	↓ C 	↑ 	↓ 	↓ 	↑ D 	↑ 	↑ 	↑ 	↓ 
 中心靜脈壓（central venous pressure），動脈壓（arterial blood pressure），心輸出量（cardiac output），混合靜脈血氧飽和度（mixed venous oxygenation saturation）
A. A
B. B
C. C
D. D

正確答案：B. B